Clinical trial inclusion criterion:
Ocular Surface Disease Index (OSDI) >12

Entity relations:
- Subsumes("Ocular Surface Disease Index", "OSDI")
- Has_value("Ocular Surface Disease Index", ">12")